Acute abdomen, patient who has diagnosed paralytic ileus or suspicious ileus

The above is a clinical trial exclusion criterion. Annotated with entity spans:
[Condition: Acute abdomen], patient who has diagnosed [Condition: paralytic ileus] or [Condition: suspicious ileus]